有關兒童白血病治療的預後因子（prognostic factor），下列何者是較好的（favorable）預後因子？
A. 有t（12；21）的染色體易位
B. 年齡小於1歲
C. 有t（4；11）的染色體易位
D. 骨髓細胞染色體數目小於44個（hypodiploidy）

正確答案：A. 有t（12；21）的染色體易位